Which chromosomes are implicated in the Emanuel syndrome?

Emanuel syndrome is associated with supernumerary chromosome t(11;22)(q23;q11), which consists of the extra genetic material from chromosomes 11 and 22.